Dysrhythmia that might pose a risk during exercise or training

The above is a clinical trial exclusion criterion. Annotated with entity spans:
[Condition: Dysrhythmia] that might [Condition: pose a risk] [Temporal: during exercise] or [Reference_point: training]